Clinical trial exclusion criterion:
Organ dysfunction (renal/hepatic failure or leukemia)

Annotated entities:
- Condition: "Organ dysfunction"
- Condition: "hepatic failure"
- Condition: "leukemia"
- Condition: "renal failure"